Mexican-american

The above is a clinical trial inclusion criterion. Annotated with entity spans:
[Person: Mexican-american]